Major neurological or medical illnesses that affect weight gain (e.g., unstable thyroid disease) or require a systemic medication that might impact weight or glucose regulation (e.g., diabetes mellitus [insulin], chronic renal failure [steroids]);

The above is a clinical trial exclusion criterion. Annotated with entity spans:
Major neurological or medical illnesses that affect weight gain (e.g., [Qualifier: unstable] [Condition: thyroid disease]) or require a systemic medication that might impact weight or glucose regulation (e.g., [Condition: diabetes mellitus] [[Drug: insulin]], [Condition: chronic renal failure] [[Drug: steroids]]);